Clinical trial inclusion criterion:
Incipient and established diabetic nephropathy (urinary albumin excretion ≥ 100 mg/day but ≤ 2000 mg/day).

Entity relations:
- Has_value("urinary albumin excretion", "≥ 100 mg/day")
- Subsumes("diabetic nephropathy", "urinary albumin excretion")
- Has_value("urinary albumin excretion", "≤ 2000 mg/day")